Una mujer de 78 años acude a Urgencias por dolor en fosa ilíaca izquierda de 24 horas de evolución asociado a fiebre y algún vómito ocasional. A la exploración destaca dolor a la palpación de forma selectiva en la fosa ilíaca izquierda con sensación de ocupación, defensa y descompresión positiva. Ante la sospecha de diverticulitis aguda. ¿Cuál de las siguientes afirmaciones es correcta?
1. La exploración complementaria más segura y de mejor rendimiento es el enema con contraste baritado.
2. En caso de absceso pélvico contenido está indicada la colocación de un drenaje percutáneo guiado con TAC o ecografía.
3. En caso de precisar intervención quirúrgica tras solucionarse el episodio agudo, el abordaje laparoscópico está contraindicado.
4. En caso de diverticulitis aguda no complicada está indicada la sigmoidectomía electiva tras la curación del primer episodio agudo.
5. Si se produjera una peritonitis generalizada, la técnica quirúrgica más adecuada es la práctica de una colostomía derivativa sin resección del segmento sigmoideo afectado.

Respuesta correcta: 2. En caso de absceso pélvico contenido está indicada la colocación de un drenaje percutáneo guiado con TAC o ecografía.